Clinical trial inclusion criteria:
30 min or more of (1) continuous clinical seizure activities or (2) recurrent seizure activities without recovery(returning to baseline)between seizures;
clinical data is complete.

Annotated entities:
- Multiplier: "30 min or more"
- Condition: "seizure"
- Condition: "seizure"
- Temporal: "continuous"
- Temporal: "recurrent"
- Qualifier: "without recovery"
- Non-query-able: "clinical data is complete."